Estimated creatinine clearance of at least 60 mL/min (using the Cockcroft-Gault equation) at screening only.

The above is a clinical trial inclusion criterion. Annotated with entity spans:
[Measurement: Estimated creatinine clearance] of [Value: at least 60 mL/min] (using the Cockcroft-Gault equation) at screening only.